下列何種情況，在川崎氏症（Kawasaki disease）孩童最少發生？
A. 冠狀動脈擴大
B. 膿尿（pyuria）
C. 補體 C3、C4 下降
D. 肝功能指數升高

正確答案：C. 補體 C3、C4 下降